Clinical trial exclusion criterion:
Polycystic ovary syndrome (PCOS) as defined by the Rotterdam criteria.

Annotated entities:
- Condition: "Polycystic ovary syndrome (PCOS)"
- Qualifier: "Rotterdam criteria"